Patient has no other comorbidities that contraindicate the procedure

The above is a clinical trial inclusion criterion. Annotated with entity spans:
Patient has [Negation: no] [Qualifier: other] [Condition: comorbidities that contraindicate the procedure]